Clinical trial exclusion criterion:
Type 1 diabetes mellitus or diabetic ketoacidosis

Annotated entities:
- Condition: "Type 1 diabetes mellitus"
- Condition: "diabetic ketoacidosis"